下肢外傷後膝蓋以下之重建手術，最困難的是那一部位？
A. 小腿上 1/3
B. 小腿中段
C. 小腿下 1/3
D. 足部

正確答案：C. 小腿下 1/3